Clinical trial exclusion criterion:
7. Unable to wean steroids to ≤0.5 mg/kg/day prednisone.

Annotated entities:
- Parsing_Error: "7."
- Drug: "steroids"
- Value: "≤0.5 mg/kg/day"
- Procedure: "wean"
- Drug: "prednisone"
- Negation: "Unable"